Clinical trial exclusion criterion:
Active alcohol or opioid substitution therapy

Entity relations:
- OR("alcohol", "opioid substitution therapy")